On chronic treatment (i.e., two weeks or more) with any medication severely affecting oral status (e.g. participants with gingival hypertrophy caused by anti-epileptics, calcium antagonists, cyclosporine and other immunosuppressive) or bone metabolism (e.g. anticoagulant medications, long-standing steroid medications -i.e. equal or more 2.5mg of prednisolone a day taken for >3 months -, anticonvulsants, immunosuppressants).

The above is a clinical trial exclusion criterion. Annotated with entity spans:
On chronic [Procedure: treatment] (i.e., [Temporal: two weeks or more]) with any medication severely affecting oral status (e.g. participants with [Condition: gingival hypertrophy] caused by [Drug: anti-epileptics], [Drug: calcium antagonists], [Drug: cyclosporine] and other [Drug: immunosuppressive]) or [Observation: bone metabolism] (e.g. [Drug: anticoagulant] medications, long-standing [Drug: steroid] medications -i.e. [Multiplier: equal or more 2.5mg] of [Drug: prednisolone] a day taken for [Temporal: >3 months] -, [Drug: anticonvulsants], [Drug: immunosuppressants]).